Clinical trial inclusion criterion:
A life expectancy of at least 3 months;

Entity relations:
- Has_value("life expectancy", "at least 3 months")